Clinical trial exclusion criterion:
Pregnancy or Lactation

Entity relations:
- OR("Pregnancy", "Lactation")